Hypoalbuminemia defined as serum albumin <2.0g/dL

The above is a clinical trial exclusion criterion. Annotated with entity spans:
[Condition: Hypoalbuminemia] defined as [Measurement: serum albumin] [Value: <2.0g/dL]